Clinical trial exclusion criterion:
Women who are pregnant or lactating

Entity relations:
- AND("Women", "pregnant")
- OR("pregnant", "lactating")